Clinical trial exclusion criterion:
Subject receiving dopamine agonists, nitrates, alpha-receptor blocking agents, or antihypertensive medication (see other exclusionary medications listed below)

Entity relations:
- OR("dopamine agonists", "nitrates", "alpha-receptor blocking agents", "antihypertensive medication")